Need of renal replacement therapy

The above is a clinical trial exclusion criterion. Annotated with entity spans:
[Mood: Need] of [Procedure: renal replacement therapy]